Which proteins remove H2A.Z in the yeast Saccharomyces cerevisiae?

Budding yeast INO80 can remove H2A.Z/H2B dimers from chromatin and replace them with H2A/H2B dimers. Removal of H2A.Z by INO80 promotes homologous recombination